Clinical trial exclusion criterion:
Concomitant use with ergot-type oxytocic drugs

Annotated entities:
- Temporal: "Concomitant"
- Drug: "ergot-type oxytocic drugs"